Clinical trial inclusion criterion:
(3) women have experienced two or more implantation failure attributed to inadequate endometrial development.

Entity relations:
- Has_qualifier("implantation", "failure")
- Has_mood("inadequate endometrial development", "attributed to")
- Has_multiplier("implantation", "two or more")
- AND("implantation", "inadequate endometrial development")